10 天大的新生兒發生焦躁不安、食慾不振及發燒現象。腰椎穿刺發現很多多形核白血球，腦脊髓液最可能培養出 E. coli 或下列何者？
A. Listeria monocytogenes
B. group B Streptococcus
C. Haemophilus influenzae
D. Neisseria meningitidis

正確答案：B. group B Streptococcus